Clinical trial inclusion criterion:
Patients with psychiatric or addictive disorder that would preclude obtaining informed consent

Annotated entities:
- Condition: "psychiatric disorder"
- Condition: "addictive disorder"